Clinical trial exclusion criterion:
Hypersensitivity to Sandostatin or any component of the formulation.

Entity relations:
- AND("Hypersensitivity", "Sandostatin")
- OR("Sandostatin", "component of the formulation")